下列何者是經由舌神經（lingual nerve）本身之神經纖維傳遞？
A. 舌前三分之二部分的一般感覺
B. 舌內肌之控制
C. 舌前三分之二部分的味覺
D. 舌下腺之分泌

正確答案：A. 舌前三分之二部分的一般感覺